Clinical trial exclusion criteria:
Immunocompromised patients:
Patients with a known congenital or acquired immunodeficiency.
Patients who received chemotherapy less than 6 weeks ago.
Patients who received corticosteroids in the last 6 weeks.
Patients who received immunosuppressive medication in the last 6 weeks (e.g. cyclosporin, cyclophosphamide, azathioprine).
Patients with chronic obstructive pulmonary disease who are on systemic corticosteroids.
Patients who require intensive care unit treatment.
Patients with tropical worm infection.
Patients with dexamethasone intolerance.
Pregnant and breastfeeding women.

Annotated entities:
- Condition: "Immunocompromised"
- Condition: "immunodeficiency"
- Qualifier: "acquired"
- Qualifier: "congenital"
- Procedure: "chemotherapy"
- Temporal: "less than 6 weeks ago"
- Drug: "corticosteroids"
- Temporal: "in the last 6 weeks"
- Procedure: "immunosuppressive medication"
- Temporal: "in the last 6 weeks"
- Drug: "cyclosporin"
- Drug: "cyclophosphamide"
- Drug: "azathioprine"
- Condition: "chronic obstructive pulmonary disease"
- Drug: "systemic corticosteroids"
- Visit: "intensive care unit"
- Condition: "tropical worm infection"
- Drug: "dexamethasone"
- Condition: "intolerance"
- Pregnancy_considerations: "Pregnant and breastfeeding women"